Clinical trial inclusion criteria:
At least two of the following additional criteria
At least 70 yrs old
Female gender
Diabetes
Creatinine clearance <60mL/min
History of gastro-intestinal or other organ bleeding
Baseline anemia
Current treatment with glycoproteins IIb-IIIa inhibitors

Annotated entities:
- Multiplier: "At least two"
- Non-representable: "At least two of the following additional criteria"
- Value: "At least 70 yrs"
- Person: "old"
- Person: "Female"
- Condition: "Diabetes"
- Measurement: "Creatinine clearance"
- Value: "<60mL/min"
- Condition: "organ bleeding"
- Condition: "gastro-intestinal bleeding"
- Qualifier: "other"
- Temporal: "History"
- Condition: "anemia"
- Temporal: "Baseline"
- Procedure: "treatment"
- Drug: "glycoproteins IIb-IIIa inhibitors"
- Temporal: "Current"